Clinical trial inclusion criterion:
Presence of liver cirrhosis

Annotated entities:
- Condition: "liver cirrhosis"